Clinical trial inclusion criterion:
Subjects must have normal or clinically acceptable physical exam

Annotated entities:
- Procedure: "physical exam"
- Value: "clinically acceptable"
- Value: "normal"